胰臟的假性囊腫（pseudocyst），最常見的原因是：
A. 寄生蟲
B. 胰臟腫瘤
C. 胰臟炎
D. 手術

正確答案：C. 胰臟炎